Clinical trial inclusion criterion:
On dual or triple antiplatelet therapy and between 12months and 14months from Bioresorbable Vascular Scaffold implantation

Annotated entities:
- Procedure: "triple antiplatelet therapy"
- Procedure: "dual antiplatelet therapy"
- Temporal: "between 12months and 14months from Bioresorbable Vascular Scaffold implantation"
- Device: "Bioresorbable Vascular Scaffold"
- Procedure: "implantation"
- Reference_point: "Bioresorbable Vascular Scaffold implantation"